Clinical trial inclusion criterion:
Stable medical history and general health

Annotated entities:
- Temporal: "Stable medical history"
- Condition: "Stable general health"